What gene test is recommended for clopidogrel?

The genetic test recommended for clopidogrel is CYP2C19 genotyping.